3. Subject underwent metal graft treatment;

The above is a clinical trial exclusion criterion. Annotated with entity spans:
3. Subject underwent [Procedure: metal graft treatment];